Clinical trial exclusion criterion:
Hyperthyroidism or hypothyroidism.

Entity relations:
- OR("Hyperthyroidism", "hypothyroidism")